Incorporan esteroles a su membrana plasmática:
1. Mycobacterium tuberculosis.
2. Micrococcus luteus.
3. Mycoplasma pneumoniae
4. Chlamidia trachomatis.
5. Rickettsia prowazekii.

Respuesta correcta: 3. Mycoplasma pneumoniae